Women only: Cannot be pregnant or nursing at baseline or plan to become pregnant during the course of the study

The above is a clinical trial exclusion criterion. Annotated with entity spans:
[Person: Women] only: [Pregnancy_considerations: Cannot be pregnant or nursing at baseline or plan to become pregnant during the course of the study]